El Sr. G. A. cuidador de su mujer que padece Enfermedad de Alzheimer, consulta a su enfermera porque ésta ha comenzado con conductas disruptivas, gritos y deambular errante. Señale la respuesta correcta respecto a este tipo de conductas:
1. Son inevitables e impredecibles.
2. Dependen únicamente de las alteraciones anatómicas.
3. Siempre hay que intentar hacer razonar al paciente sobre sus fallos.
4. Pueden ser una forma de expresar inseguridad o frustración por parte de la paciente.
5. El tratamiento farmacológico es la primera opción para tranquilizar a la paciente.

Respuesta correcta: 4. Pueden ser una forma de expresar inseguridad o frustración por parte de la paciente.